下列有關前列腺特定抗原（PSA）之敘述，何者錯誤？
A. PSA 每年若增加 0.75 ng/mL 以上時，有可能潛藏前列腺癌
B. 前列腺良性肥大時每公克組織 PSA 濃度可增加 0.12 ng/mL
C. PSA density 超過 0.15 ng/mL 時應作切片
D. 約 10%血清 PSA 與 α1-antichymotrypsin 結合

正確答案：D. 約 10%血清 PSA 與 α1-antichymotrypsin 結合